Clinical trial inclusion criterion:
Platelet count ≥100 x 109 /L.

Annotated entities:
- Measurement: "Platelet count"
- Value: "≥100 x 109 /L"